Which method is Proseek based on?

proximity extension immunoassay